Clinical trial inclusion criterion:
At least one CTO lesions located in proximal or mid epicardial coronary artery. (If the patient has two CTO lesions, one CTO lesion should be located in proximal or mid epicardial coronary artery)

Annotated entities:
- Multiplier: "At least one"
- Condition: "CTO lesions"
- Qualifier: "in proximal coronary artery"
- Qualifier: "mid epicardial coronary artery"
- Condition: "coronary artery"
- Parsing_Error: "If the patient has two CTO lesions, one CTO lesion should be located in proximal or mid epicardial coronary artery"